Clinical trial exclusion criterion:
Multiple premature ventricular or atrial contractions

Annotated entities:
- Condition: "Multiple premature ventricular contractions"
- Condition: "Multiple premature atrial contractions"